Which type of analysis does DeSeq2 perform?

DesSeq2 is widely used for differential gene expression analysis.